the child has as a mid upper arm circumference < 110 mm and is older than 6 months (most feasible local indicator of AIDS and chronic immunosuppressive disease)

The above is a clinical trial exclusion criterion. Annotated with entity spans:
the [Person: child] has as a [Measurement: mid upper arm circumference] [Value: < 110 mm] and [Value: is older than 6 months] [Non-representable: (most feasible local indicator of AIDS and chronic immunosuppressive disease)]